Clinical trial exclusion criterion:
Pregnant, breast-feeding women or women who plan to become pregnant during this study (Females of childbearing potential must have a negative urine pregnancy test)

Annotated entities:
- Condition: "Pregnant"
- Condition: "breast-feeding"
- Person: "women"
- Person: "women"
- Non-query-able: "plan to become"
- Condition: "pregnant"
- Temporal: "during this study"
- Condition: "childbearing potential"
- Person: "Females"
- Measurement: "urine pregnancy test"
- Value: "negative"